Clinical trial exclusion criterion:
Coagulopathy or taking anticoagulants responsible an INR> 1.3 or a platelet count <75,000 per microL,

Entity relations:
- Has_value("INR", "> 1.3")
- Has_value("platelet count", "<75,000 per microL")
- OR("INR", "platelet count")
- OR("Coagulopathy", "anticoagulants")